下列有關酵素異常的敘述，何者最可能導致痛風（gout）的發生？
A. 缺乏citrate synthase
B. 5-phosphoribosyl-1-pyrophosphate synthetase活性降低
C. hypoxanthine-guanine phosphoribosyltransferase活性降低
D. glucose 6-phosphatase表現量上升

正確答案：C. hypoxanthine-guanine phosphoribosyltransferase活性降低